What is Morel–Lavallée lesion?

Morel-Lavallée lesion is a closed degloving soft-tissue injury that results in the accumulation of a hemolymphatic fluid between the skin/superficial fascia and the deep fascia.